active bowel inflammation

The above is a clinical trial exclusion criterion. Annotated with entity spans:
[Temporal: active] [Condition: bowel inflammation]